Clinical trial exclusion criterion:
Any known psychiatric disorder

Annotated entities:
- Condition: "psychiatric disorder"